下列那一種葡萄糖轉運子（glucose transporter，GLUT）是負責運送葡萄糖進入胰臟貝他細胞（β cell）？
A. GLUT1
B. GLUT2
C. GLUT3
D. GLUT4

正確答案：B. GLUT2